Clinical trial inclusion criterion:
Volunteer chronically infected with HCV (as demonstrated by serology and/or viral load laboratory studies)

Entity relations:
- Has_qualifier("HCV infected", "chronically")